Austrian syndrome is a rare entity characterized by Osler's triad. Please list the 3 components of Osler's triad.

Austrian syndrome is a rare triad of meningitis, pneumonia, and endocarditis caused by Streptococcus pneumoniae